Clinical trial exclusion criterion:
Contraindication for ketamine infusion

Annotated entities:
- Condition: "Contraindication"
- Drug: "ketamine"
- Procedure: "ketamine infusion"